Clinical trial exclusion criterion:
1. Use of any medication within the 14 days prior to the initial dose of study medication.

Annotated entities:
- Parsing_Error: "1."
- Drug: "medication"
- Temporal: "within the 14 days prior"
- Reference_point: "the initial dose of study medication"